Clinical diagnosis of hepatic or renal disease

The above is a clinical trial exclusion criterion. Annotated with entity spans:
[Qualifier: Clinical diagnosis] of [Condition: hepatic] or [Condition: renal disease]